What is dystopia canthorum?

Dystopia canthorum is defined as a prominent broad nasal root with increased intercanthal distance.